有關唾液腺腫瘤（tumors of salivary gland），下列敘述何者錯誤？
A. 唾液腺腫瘤通常發生於三大唾液腺（major salivary glands）
B. 僅小部分的唾液腺腫瘤發生於口腔黏膜的小唾液腺（minor salivary glands）
C. 約有80%的唾液腺腫瘤是惡性的
D. 小唾液腺腫瘤（minor salivary gland tumors）最易發生於腭部（palate）

正確答案：C. 約有80%的唾液腺腫瘤是惡性的